對於先天性母斑（congenital nevus）的敘述，下列何者錯誤？
A. 太田氏母斑（nevus of Ota）多為單側，好發於三叉神經第一或第二分支處
B. 蒙古斑（Mongolian spot）隨	年紀增長會逐漸淡化或消失
C. 皮脂腺母斑（nevus sebaceous）常伴隨皮膚增厚及多毛的現象
D. 先天性黑色素細胞痣（congenital melanocytic nevus）通常範圍越大者其轉變成惡性腫瘤機率就越高

正確答案：C. 皮脂腺母斑（nevus sebaceous）常伴隨皮膚增厚及多毛的現象